Clinical trial exclusion criterion:
Refusal for organ procurement by the donor (confirmed by the French national register or reported by the next-of-kin).

Annotated entities:
- Procedure: "organ procurement"
- Observation: "Refusal by the donor"
- Qualifier: "French national register"
- Qualifier: "reported by the next-of-kin"